Clinical trial exclusion criterion:
Currently receiving immunosuppressive or myelosuppressive therapy with, for example, monoclonal antibodies, methotrexate, cyclophosphamide, cyclosporine or azathioprine, or chronic use of corticosteroids.

Annotated entities:
- Procedure: "immunosuppressive therapy"
- Procedure: "myelosuppressive therapy"
- Temporal: "Currently"
- Drug: "monoclonal antibodies"
- Drug: "methotrexate"
- Drug: "cyclophosphamide"
- Drug: "cyclosporine"
- Drug: "azathioprine"
- Drug: "corticosteroids"
- Multiplier: "chronic use"